一位 60 歲男性病人，因發燒，右側胸痛而住院。胸部X光顯示有少量右側肋膜腔積水，抽水檢查顯 示其為exudate，WBC：8,800/mm3且細胞主要為多核中性白血球（85%），pH值為 7.28，Sugar為 76 mg/dL。下列何種處理為最適當？
A. 開始給予抗生素治療，並追蹤胸部 X 光片檢查
B. 給予抗生素，並即時插胸管引流肋膜腔積水
C. 使用抗結核藥物治療
D. 等候細胞學檢查結果，再決定後續治療

正確答案：A. 開始給予抗生素治療，並追蹤胸部 X 光片檢查